Clinical trial inclusion criterion:
Basic understanding of the study as determined by the physician

Annotated entities:
- Non-query-able: "Basic understanding of the study as determined by the physician"